Clinical trial inclusion criterion:
Kindergarteners who have joined our outreach dental service will be invited to join this study. Preschool children aged 3-4 years who have tooth decay and are attending the first year of kindergarten will be invited to join this study.

Entity relations:
- Has_value("aged", "3-4 years")